Clinical trial inclusion criterion:
CAD:Presence of any one of the following: Angina plus positive exercise tolerance test, enzyme and/or Q wave positive myocardial infarction, angiographic evidence ( >50% stenosis of one vessel), percutaneous or surgical coronary revascularisation.

Entity relations:
- Has_value("exercise tolerance test", "positive")
- Has_qualifier("myocardial infarction", "enzyme positive")
- Has_value("stenosis of one vessel", ">50%")
- Subsumes("angiographic evidence", "stenosis of one vessel")
- Has_qualifier("coronary revascularisation", "percutaneous")
- Subsumes("CAD", "Angina")
- Subsumes("CAD", "exercise tolerance test")
- OR("enzyme positive", "Q wave positive")
- OR("Angina", "myocardial infarction", "coronary revascularisation", "angiographic evidence")
- OR("percutaneous", "surgical")
- OR("exercise tolerance test", "myocardial infarction", "coronary revascularisation", "angiographic evidence")